Which cancers compose Carney's triad?

Carney's triad is a rare pathogenic entity which consists of 3 rare soft tissue tumors: gastric leiomyosarcoma, pulmonary chondroma and extraadrenal paraganglioma. It is usually diagnosed in young women. The presence of three tumors at the same time is not required for its diagnosis (incomplete Carney's Triad).